Clinical trial exclusion criterion:
Infection in or near insertion site of the peripheral nerve catheter

Entity relations:
- Has_qualifier("peripheral nerve catheter", "in insertion site")
- OR("in insertion site", "near insertion site")